Presence of acid reflux or heartburn symptoms of more than twice a month

The above is a clinical trial exclusion criterion. Annotated with entity spans:
Presence of [Condition: acid reflux] or [Condition: heartburn symptoms] of [Temporal: more than twice a month]